Hypersensitivity on Colchicine

The above is a clinical trial exclusion criterion. Annotated with entity spans:
[Condition: Hypersensitivity] on [Drug: Colchicine]